Clinical trial exclusion criterion:
definite radiographic evidence of osteoarthritis of the glenohumeral joint

Entity relations:
- Has_qualifier("osteoarthritis", "glenohumeral joint")
- multi("radiographic evidence", "radiographic")
- Has_mood("osteoarthritis", "radiographic evidence")
- Has_qualifier("radiographic evidence", "definite")